Clinical trial inclusion criteria:
HBsAg-positive for more than 6 months (HBeAg-positive or HBeAg-negative).
Age > 20 y/o.
Under lamivudine/adefovir treatment for more than 1 year due to previous lamivudine resistance (LAM-R), current HBV DNA is undetectable (< 20 IU/ml) during enrollment.

Annotated entities:
- Measurement: "HBsAg"
- Value: "positive"
- Temporal: "more than 6 months"
- Measurement: "HBeAg"
- Value: "positive"
- Measurement: "HBeAg"
- Value: "negative"
- Person: "Age"
- Value: "> 20 y/o"
- Drug: "lamivudine"
- Drug: "adefovir"
- Temporal: "more than 1 year"
- Observation: "lamivudine resistance"
- Observation: "LAM-R"
- Measurement: "HBV DNA"
- Value: "undetectable"
- Value: "< 20 IU/ml"
- Temporal: "during enrollment"
- Reference_point: "enrollment"